adult patients aged = 55 years with

The above is a clinical trial inclusion criterion. Annotated with entity spans:
[Person: adult] patients [Person: aged] [Value: = 55 years] with